Clinical trial exclusion criterion:
Radiopaque material implanted in the chest wall (metal, silicone, etc.)

Annotated entities:
- Device: "Radiopaque material"
- Qualifier: "chest wall"